Describe the Enhancing NeuroImaging Genetics through Meta-Analysis (ENIGMA) Consortium

The ENIGMA Consortium is a global team science effort, now including over 800 scientists spread across 340 institutions in 35 countries, with the shared goal of understanding disease and genetic influences on the brain.